Clinical trial inclusion criterion:
Lipids: one group with an LDL =/>130 and Triglycerides < 150 mg/dL The 2nd group will have and LDL=/>130 mg/dL and Triglycerides =/>150 mg/dL but less than 400 mg/dL.

Entity relations:
- Has_value("LDL", "=/>130")
- Has_value("Triglycerides", "< 150 mg/dL")